Clinical trial inclusion criterion:
Patients on Sandostatin Lar (long acting somatostatin analogue) must be on a stable dose for 30 days prior to study entry and short acting somatostatin analogues must be judged to be on a clinically stable dose by the investigator prior to study entry

Entity relations:
- Subsumes("Sandostatin Lar", "long acting somatostatin analogue")
- Has_temporal("clinically stable dose", "prior to study entry")
- Has_qualifier("Sandostatin Lar", "stable dose")
- Has_temporal("stable dose", "for 30 days prior to study entry")
- Has_qualifier("short acting somatostatin analogues", "clinically stable dose")